Clinical trial inclusion criterion:
normal treadmill stress test

Annotated entities:
- Measurement: "treadmill stress test"
- Value: "normal"